Clinical trial exclusion criterion:
Anticoagulant treatment after the operation (e.g. warfarin, direct thrombin inhibitors (dabigatran), FXa inhibitors (rivaroxaban, apixaban, heparin, low-molecular weight heparin, fondaparinux)

Entity relations:
- multi("the operation", "operation")
- Has_index("after the operation", "the operation")
- Has_temporal("Anticoagulant treatment", "after the operation")
- Subsumes("direct thrombin inhibitors", "dabigatran")
- Subsumes("FXa inhibitors", "rivaroxaban")
- Subsumes("Anticoagulant treatment", "warfarin")
- OR("rivaroxaban", "apixaban", "heparin", "low-molecular weight heparin", "fondaparinux")
- OR("warfarin", "direct thrombin inhibitors", "FXa inhibitors")